最常見於蛋白質之三級結構內部的共價交互作用為：
A. 氫鍵（hydrogen bond）
B. 凡德瓦爾力（van der Waals interaction）
C. 離子交互作用（ionic interaction）
D. 雙硫鍵（disulfide bond）

正確答案：D. 雙硫鍵（disulfide bond）